Current substance abuse (e.g., alcohol, cocaine, heroin, etc.)

The above is a clinical trial inclusion criterion. Annotated with entity spans:
Current [Condition: substance abuse] (e.g., alcohol, cocaine, heroin, etc.)